dNMB with rocuronium during ear nose and throat (ENT) surgery

The above is a clinical trial inclusion criterion. Annotated with entity spans:
[Drug: dNMB with rocuronium] during [Procedure: ear nose and throat (ENT) surgery]